Clinical trial exclusion criterion:
Vasculitis

Annotated entities:
- Condition: "Vasculitis"